Clinical trial inclusion criterion:
Subjects referred to diagnostic or therapeutic colonoscopy.

Entity relations:
- Has_context("colonoscopy", "diagnostic")
- OR("diagnostic", "therapeutic")